Clinical trial exclusion criterion:
Myopia > 6D;

Annotated entities:
- Measurement: "Myopia"
- Value: "> 6D"